若一病人在進行甲狀腺切除手術時，不慎將其副甲狀腺一併切除，下列何現象最不可能發生？
A. 短時間內會造成血鈣和磷濃度降低
B. 會造成神經肌肉系統過度興奮（hyperexcitability）
C. 造成手足抽搐（tetany）
D. 造成腎臟排泄血中磷含量之功能下降

正確答案：A. 短時間內會造成血鈣和磷濃度降低